What is the inheritance pattern of Apert syndrome?

The Apert syndrome is a disorder of autosomal dominant inheritance.